Clinical trial exclusion criterion:
allergy/contra-indication for any drug used in the study

Annotated entities:
- Condition: "allergy"
- Condition: "contra-indication"
- Drug: "drug used in the study"